Clinical trial inclusion criterion:
Patient should be negative for HIV and B and C hepatitis.

Entity relations:
- Has_value("HIV", "negative")
- Has_value("C hepatitis", "negative")
- Has_value("B hepatitis", "negative")